Patients with signs or symptoms of SVC syndrome, or hepatic cirrhosis not felt due to passive congestion from TR.

The above is a clinical trial exclusion criterion. Annotated with entity spans:
Patients with signs or symptoms of [Condition: SVC syndrome], or [Condition: hepatic cirrhosis] not felt due to [Condition: passive congestion from TR].